Clinical trial exclusion criterion:
Patients who receive antineoplastic or immunomodulatory therapy in the past 12 months.

Annotated entities:
- Procedure: "antineoplastic therapy"
- Procedure: "immunomodulatory therapy"
- Temporal: "past 12 months"